志明（血型B型）和春嬌（血型AB型）結婚後生下女兒小英（血型A型）。他們的下一個小孩血型為B型的機會正常狀態下為多少百分比？
A. 0
B. 25
C. 33
D. 50

正確答案：D. 50